Clinical trial exclusion criterion:
Patients with a history of pulmonary embolism, or untreated deep vein thrombosis within the past 6 months

Annotated entities:
- Condition: "pulmonary embolism"
- Condition: "deep vein thrombosis"
- Qualifier: "untreated"
- Temporal: "within the past 6 months"
- Temporal: "history"